72歲的吳女士過去無子宮頸癌病史，過去連續三年的子宮頸抹片檢查皆為正常，目前已無性行為。最近至衛生所接受成人健檢時，吳女士詢問醫師是否應該繼續接受抹片檢查，以及是否可以接受人類乳突狀病毒疫苗 的注射。下列敘述何者正確？
A. 子宮頸抹片篩檢屬於公共衛生的初段預防
B. 吳女士不需再接受子宮頸抹片檢查
C. 根據美國癌症學會建議，吳女士接受子宮頸抹片檢查的年齡不應有上限
D. 應建議吳女士接受人類乳突狀病毒疫苗注射

正確答案：B. 吳女士不需再接受子宮頸抹片檢查